List human proteins that are subject to a dimer-to-tetramer transition.

GAC
SHMT2
AMPAR
Orai1
Orai3